Clinical trial exclusion criterion:
History of obstructive urinary disorders and dysuria, prostatic hypertrophy, prostatitis, and other lower urinary tract obstructive disorders.

Annotated entities:
- Condition: "obstructive urinary disorders"
- Condition: "dysuria"
- Condition: "prostatic hypertrophy"
- Condition: "prostatitis"
- Condition: "lower urinary tract obstructive disorders"
- Qualifier: "other"
- Temporal: "History"